8. Subject and the treating physician agree that the subject will comply with all follow-up evaluations.

The above is a clinical trial inclusion criterion. Annotated with entity spans:
8. [Post-eligibility: Subject and the treating physician agree that the subject will comply with all follow-up evaluations.]